Agreement to the trial protocol, including the randomized manner

The above is a clinical trial inclusion criterion. Annotated with entity spans:
[Post-eligibility: Agreement to the trial protocol, including the randomized manner]